Clinical trial exclusion criterion:
Parkinson's disease with hallucinations

Entity relations:
- AND("Parkinson's disease", "hallucinations")